Clinical trial inclusion criterion:
1. low serum levels of HDL cholesterol (<40 mg⁄dL for men or < 50 mg ⁄dL for women);

Entity relations:
- Has_value("serum levels of HDL cholesterol", "low")
- Has_value("men", "<40 mg⁄dL")
- Has_value("women", "< 50 mg ⁄dL")
- Subsumes("low", "men")
- Subsumes("low", "women")